Any confirmed or suspected immunosuppressive or immunodeficient condition, based on medical history and physical examination (no laboratory testing required).

The above is a clinical trial exclusion criterion. Annotated with entity spans:
Any [Qualifier: confirmed] or [Qualifier: suspected] [Condition: immunosuppressive] or [Condition: immunodeficient condition], based on medical history and physical examination (no laboratory testing required).